Clinical trial inclusion criterion:
Bilirubin level at/above 100 umol per liter (5.8 mg/dL)

Entity relations:
- Subsumes("at/above 100 umol per liter", "at/above 5.8 mg/dL")
- Has_value("Bilirubin level", "at/above 100 umol per liter")